Clinical trial inclusion criterion:
Intracranial or cerebral haemorrhage

Entity relations:
- OR("Intracranial haemorrhage", "cerebral haemorrhage")